Clinical trial inclusion criteria:
Women with a singleton pregnancy undergoing cesarean section after 37 weeks of gestation.

Annotated entities:
- Person: "Women"
- Condition: "singleton pregnancy"
- Procedure: "cesarean section"
- Value: "after 37 weeks"
- Measurement: "gestation"